Clinical trial exclusion criterion:
Respiratory failure:

Annotated entities:
- Condition: "Respiratory failure"